下列有關嚴重急性呼吸道症候群（severe acute respiratory syndrome，簡稱 SARS）的敘述，何者正確？ ①是由新的冠狀病毒（coronavirus）引起的 ② SARS 病毒是 DNA 病毒 ③病毒量在發病（發燒）第 1~4 天最多 ④病毒量在發病（發燒）後 10 天達到高峰
A. ①③
B. ①④
C. ②④
D. ①②④

正確答案：B. ①④